¿Cuál de los siguientes momentos del electrocardiograma corresponde a la etapa de despolarización del miocardio ventricular?:
1. Onda P.
2. Onda T.
3. Segmento T-P.
4. Segmento P-Q.
5. Onda QRS.

Respuesta correcta: 5. Onda QRS.